History of alcohol or drug abuse (as defined by the current version of the DSM) within 2 years before the first dose administration, or positive alcohol or drug screen.

The above is a clinical trial exclusion criterion. Annotated with entity spans:
[Temporal: History] of [Condition: alcohol] or [Condition: drug abuse] (as defined by the [Procedure: current version of the DSM]) [Temporal: within 2 years before] [Reference_point: the first dose administration], or [Value: positive] [Measurement: alcohol] or [Measurement: drug screen].